一位 36 歲男性病患被送入急診，主訴為 30 分鐘前開始突發性呼吸困難，伴隨有喉嚨腫脹與胸悶。病人意識尚清楚，血壓為 70/30 mmHg，心跳為 130/分，呼吸速率為 32/分，體溫為 36.8℃。理學檢查發現全身體表皮膚發紅（cutaneous flushing），二側肺皆有哮喘音（wheezing）。家屬表示以前身體很健康，無任何病史，最近因為咳嗽、流鼻水而到附近診所求治，醫師表示可能為細菌感染需要 吃抗生素治療，發作前半小時才吃第一次藥。依此病人的臨床表現，下列何種疾病最有可能？
A. 急性氣管炎（acute bronchitis）
B. 氣喘發作（asthma attack）
C. 過敏性反應（anaphylaxis）
D. 急性冠心症候群（acute coronary syndrome）

正確答案：C. 過敏性反應（anaphylaxis）